Clinical trial exclusion criterion:
Patients with a calculated PRA higher than 0% per solid phase and / or anti-HLA class I and / or class II antibodies detectable by single antigen test (Luminex®).

Annotated entities:
- Measurement: "calculated PRA"
- Value: "higher than 0% per solid phase"
- Procedure: "single antigen test"
- Value: "anti-HLA class I"
- Value: "anti-HLA class II"
- Procedure: "Luminex"